Creatinine clearance (estimated by Cockcroft-Gault) <30 ml / min.

The above is a clinical trial exclusion criterion. Annotated with entity spans:
[Measurement: Creatinine clearance] (estimated by [Qualifier: Cockcroft-Gault]) [Value: <30 ml / min].